Clinical trial exclusion criterion:
The patient has a contraindication (or an incompatible drug association) for a treatment used in this study

Annotated entities:
- Condition: "contraindication"
- Non-representable: "The patient has a contraindication (or an incompatible drug association) for a treatment used in this study"